Which company originally developed the drug Afrezza?

The inhaled insulin Technosphere, also known as Afrezza is produced by the MannKind Corporation.